Clinical trial inclusion criterion:
Foveal subretinal fluid (SRF), on optical coherence tomography (OCT), at Baseline Examination;

Annotated entities:
- Condition: "Foveal subretinal fluid (SRF)"
- Procedure: "optical coherence tomography (OCT)"
- Temporal: "at Baseline Examination"
- Reference_point: "Baseline Examination"